Subject requiring a spine DEXA (i.e., patients with SCORE of = 6) with a T Score less than -2.0 at the index level. For patients with a herniation at L5/S1, the average T score of L1-L4 shall be used.

The above is a clinical trial exclusion criterion. Annotated with entity spans:
Subject [Mood: requiring] a [Procedure: spine DEXA] (i.e., patients with [Measurement: SCORE] of [Value: = 6]) with a [Measurement: T Score] [Value: less than -2.0] at the [Qualifier: index level]. For patients with a [Condition: herniation] at [Qualifier: L5/S1], the [Measurement: average T score] of [Qualifier: L1-L4] [Non-representable: shall be used].